Hepatic insufficiency.

The above is a clinical trial exclusion criterion. Annotated with entity spans:
[Condition: Hepatic insufficiency].